Clinical trial inclusion criterion:
Age >12 months

Annotated entities:
- Person: "Age"
- Value: ">12 months"